No prior therapy

The above is a clinical trial inclusion criterion. Annotated with entity spans:
[Non-representable: No prior therapy]